Clinical trial inclusion criterion:
Aged 18 years or older, male or female.

Annotated entities:
- Value: "18 years or older"
- Person: "Aged"
- Person: "male"
- Person: "female"